Clinical trial exclusion criteria:
Have osteoporosis
Have a 10 yr probability of hip fracture >3% or major fracture >20% based on results of the FRAX tool
Currently take bisphosphonates, estrogen replacement therapy, glucocorticosteroids, or other drugs affecting bone
Currently participate in a resistance training or high impact weight bearing exercise program two or more times weekly
Weigh >300 lbs
Have abnormal results for the following laboratory tests: serum 25(OH)D; serum creatinine; serum calcium; PTH; TSH
Have Paget's disease, heart disease, uncontrolled hypertension, renal disease, or other concomitant conditions that prohibit participation in exercises, risedronate therapy, or use of CaD supplements.

Annotated entities:
- Condition: "osteoporosis"
- Measurement: "10 yr probability of hip fracture"
- Condition: "hip fracture"
- Value: ">3%"
- Measurement: "10 yr probability of major fracture"
- Condition: "major fracture"
- Undefined_semantics: "major fracture"
- Value: ">20%"
- Drug: "bisphosphonates"
- Procedure: "estrogen replacement therapy"
- Drug: "glucocorticosteroids"
- Drug: "drugs affecting bone"
- Undefined_semantics: "drugs affecting bone"
- Condition: "participate in a resistance training"
- Non-query-able: "participate in a resistance training"
- Condition: "participate in high impact weight bearing exercise"
- Non-query-able: "participate in high impact weight bearing exercise"
- Multiplier: "two or more times weekly"
- Measurement: "Weigh"
- Value: ">300 lbs"
- Value: "abnormal results"
- Measurement: "serum 25(OH)D"
- Measurement: "serum creatinine"
- Measurement: "serum calcium"
- Measurement: "PTH"
- Measurement: "TSH"
- Condition: "Paget's disease"
- Condition: "heart disease"
- Condition: "uncontrolled hypertension"
- Condition: "renal disease"
- Condition: "other concomitant conditions that prohibit participation in exercises"
- Undefined_semantics: "other concomitant conditions that prohibit participation in exercises"
- Procedure: "risedronate therapy"
- Drug: "CaD supplements"